Diagnosis of a sleep disorder other than insomnia including PSG findings of apnea/hypopnea or periodic limb movement indices > 10/hour;

The above is a clinical trial exclusion criterion. Annotated with entity spans:
Diagnosis of a [Condition: sleep disorder] [Negation: other] than [Condition: insomnia] including [Measurement: PSG] findings of [Condition: apnea]/[Condition: hypopnea] or [Measurement: periodic limb movement indices] [Value: > 10/hour];